Clinical trial inclusion criterion:
Patient has to voluntarily join the study and sign the Informed Consent Form for the study;

Annotated entities:
- Informed_consent: "Patient has to voluntarily join the study and sign the Informed Consent Form for the study;"